Which are the components of the pre-replication complex (pre-RC) in eukaryotes?

The components of the pre-replication complex (pre-RC) in eukaryotes are:
1) Cdc6/Cdc18, 
2) MCM, 
3) ORC1-6,
4) Cdt1 and
5) Sap1/Gi.